La ATP sintasa:
1. Genera ATP por un mecanismo de catálisis rotacional.
2. Se encuentra en la membrana del retículo endoplásmico.
3. Sintetiza ATP cuando los electrones fluyen a través de ella.
4. Presenta un canal de electrones.
5. Consume ATP por hidrólisis acoplada al transporte de electrones.

Respuesta correcta: 1. Genera ATP por un mecanismo de catálisis rotacional.